La aproximación a la Evaluación Psicológica desde un modelo constructivista se caracteriza por el uso de técnicas :
1. Proyectivas que evalúan rasgos.
2. Subjetivas que evalúan significados.
3. Psicométricas que evalúan constructos.
4. Conductuales que evalúan repertorios.
5. Observacionales que evalúan variables ambientales.

Respuesta correcta: 2. Subjetivas que evalúan significados.